Clinical trial exclusion criterion:
Affected by alcohol or drugs during the last month.

Annotated entities:
- Observation: "alcohol"
- Observation: "drugs"
- Temporal: "last month"